Clinical trial inclusion criterion:
Premorbid IQ of over 70

Entity relations:
- Has_value("Premorbid IQ", "over 70")